Clinical trial exclusion criterion:
Active malignancy or infection

Annotated entities:
- Condition: "malignancy"
- Qualifier: "Active"
- Condition: "infection"